Clinical trial inclusion criterion:
Children 2-5 years with negative TSTs who have been in close contact with a case of active TB disease recently

Entity relations:
- Has_value("years", "2-5")
- Has_value("TSTs", "negative")